Clinical trial inclusion criterion:
Subject is scheduled for a procedure that requires general or neuraxial anesthesia

Annotated entities:
- Procedure: "procedure"
- Mood: "scheduled for a procedure"
- Procedure: "neuraxial anesthesia"
- Procedure: "general t"